Clinical trial exclusion criterion:
known diabetes

Annotated entities:
- Condition: "diabetes"